Clinical trial inclusion criteria:
Adult patient being referred for clinically indicated positron emission tomography myocardial perfusion imaging at the Centre hospitalier de l'Université de Montréal

Annotated entities:
- Person: "Adult"
- Qualifier: "clinically indicated"
- Procedure: "positron emission tomography myocardial perfusion imaging"
- Visit: "Centre hospitalier de l'Université de Montréal"